Diabetes Mellitus (insulin therapy)

The above is a clinical trial exclusion criterion. Annotated with entity spans:
[Condition: Diabetes Mellitus] ([Drug: insulin] therapy)